某位醫師想研究一種新的抗病毒藥物（antiviral agent）對一般感冒的療效，她的作法是針對 100 名 2~8 歲的兒童進行實驗，給這 100 名感冒的兒童服用此新的藥物，一週過後她發現：其中的 90 位病童症狀緩解了。因此她認為這種新的藥物非常具有療效。關於這位醫師的結論不正確的理由為何？
A. 因為該醫師使用盛行率而非發生率
B. 因為對於結果的描述缺乏明確的分母
C. 因為結果無法推論至目標族群
D. 因為缺乏適當的對照組

正確答案：D. 因為缺乏適當的對照組